Clinical trial exclusion criterion:
Thunderclap onset of the headache

Annotated entities:
- Condition: "Thunderclap onset"
- Condition: "headache"